Clinical trial exclusion criterion:
Any organic lesion with high risk of bleeding (e.g.: active peptic ulcer, hemorrhagic stroke, cerebral aneurysm or cerebral neoplasms).

Annotated entities:
- Condition: "organic lesion"
- Observation: "risk of bleeding"
- Qualifier: "high"
- Condition: "active peptic ulcer"
- Condition: "hemorrhagic stroke"
- Condition: "cerebral aneurysm"
- Condition: "cerebral neoplasms"